Patients whose medical condition does preclude the PLR manoeuvre

The above is a clinical trial exclusion criterion. Annotated with entity spans:
[Non-query-able: Patients whose medical condition does preclude the PLR manoeuvre]